Clinical trial exclusion criterion:
Known allergic reaction to tranexamic acid

Entity relations:
- AND("allergic", "tranexamic acid")